Healthy children aged 6 months to 72 months

The above is a clinical trial inclusion criterion. Annotated with entity spans:
[Condition: Healthy] [Person: children] [Person: aged] [Value: 6 months to 72 months]